Clinical trial exclusion criterion:
History of allergy or hypersensitivity to Sugammadex and/or atropine or Neostigmine

Entity relations:
- AND("allergy", "Sugammadex")
- Has_temporal("allergy", "History")
- OR("Sugammadex", "Neostigmine", "atropine")
- OR("allergy", "hypersensitivity")